Genera fragmentos romos de ADN el enzima de restricción:
1. Bam HI.
2. Hae III.
3. Hind III.
4. Eco RI.
5. Eco RII.

Respuesta correcta: 2. Hae III.